心肌梗塞（myocardial infarction）的病人急性期（第一期）的復健原則不包含下列那一項？
A. 儘早活動（early mobilization）
B. 可以下二層樓梯
C. 從事身體活動2～3 METS以內的運動
D. 運動中需要監控血壓上升或下降不可超過20mmHg

正確答案：D. 運動中需要監控血壓上升或下降不可超過20mmHg